Clinical trial exclusion criterion:
Patients are known to have impaired liver function, evidenced by ALT values within normal limits, and no previous liver disease.

Annotated entities:
- Value: "impaired"
- Measurement: "liver function"
- Measurement: "ALT values"
- Value: "within normal limits"
- Negation: "no"
- Temporal: "previous"
- Condition: "liver disease"